Clinical trial exclusion criterion:
Sever renal impairment (S. creatinine more than 3)

Entity relations:
- Has_value("creatinine", "more than 3")
- Has_qualifier("renal impairment", "Sever")
- Subsumes("renal impairment", "creatinine")